Clinical trial inclusion criterion:
Must agree not to donate blood or other bodily fluid while taking the study drug and for 28 days thereafter

Entity relations:
- Has_negation("Must agree to", "not")
- Has_mood("donate blood", "Must agree to")
- Has_mood("donate bodily fluid", "Must agree to")
- multi("taking the study drug", "study drug")
- multi("while taking the study drug", "taking the study drug")
- Subsumes("donate blood", "while taking the study drug")